Significant suicide or violence risk

The above is a clinical trial exclusion criterion. Annotated with entity spans:
[Qualifier: Significant] [Condition: suicide] or [Condition: violence risk]